開放性骨折（open fracture）是骨科急症之一，下列敘述何者正確？
A. 根據Gustilo-Anderson分類，開放性傷口小於1公分，同時沒有嚴重的軟組織傷害者，為 type III injury
B. 所有的開放性骨折病患送至急診時，在完成初步傷口清洗後，骨科醫師應在第一時間在急診做傷口探查、清創及縫合；即便1
C. 傷口沖洗、清創及抗生素治療是預防開放性骨折後發生感染最重要的處理原則。若傷口清創不完全，靠大量抗生素的使用可完全避免感染的發生
D. 對於type I及type II開放性骨折，在急診室時可選用第一代頭孢菌素（first-generation cephalosporins）治療；對於typeIII開放性骨折建議再加上氨基配醣體類抗生素（aminoglycosides）

正確答案：D. 對於type I及type II開放性骨折，在急診室時可選用第一代頭孢菌素（first-generation cephalosporins）治療；對於typeIII開放性骨折建議再加上氨基配醣體類抗生素（aminoglycosides）